下列那一種抗生素，適合用來治療嗜肺性退伍軍人菌（Legionella pneumophila）所引起的肺炎？
A. 克林達黴素（clindamycin）
B. 阿奇黴素（azithromycin）
C. 安比西林（ampicillin）
D. 兩性黴素B（amphotericin B）

正確答案：B. 阿奇黴素（azithromycin）